Clinical trial exclusion criterion:
Known hypersensitivity to Ferinject®.

Entity relations:
- AND("hypersensitivity", "Ferinject®")